La distrofia muscular de Becker es una alteración de:
1. El músculo esquelético.
2. El metabolismo de lípidos.
3. Los huesos.
4. Origen hepático.
5. La bilirrubina.

Respuesta correcta: 1. El músculo esquelético.